Systolic blood pressure >/= 90 mmHg

The above is a clinical trial inclusion criterion. Annotated with entity spans:
[Measurement: Systolic blood pressure] [Value: >/= 90 mmHg]